Clinical trial exclusion criterion:
Subject has used non-steroidal anti-inflammatory drugs including aspirin, two times per week, during the 4 weeks preceding enrollment. Low dose aspirin regimens (< 100 mg daily) are acceptable and not exclusionary.

Annotated entities:
- Drug: "non-steroidal anti-inflammatory drugs"
- Drug: "aspirin"
- Multiplier: "two times per week"
- Temporal: "during the 4 weeks preceding"
- Reference_point: "enrollment"
- Drug: "aspirin"
- Multiplier: "< 100 mg daily"
- Qualifier: "Low dose"
- Grammar_Error: "not exclusionary"